Clinical trial inclusion criterion:
Sensation of incomplete evacuation for =25% of defecations

Annotated entities:
- Condition: "Sensation of incomplete evacuation"
- Multiplier: "=25%"
- Condition: "defecations"